Immunosuppressive therapy or renal dialysis (current or planned within the next 6 months).

The above is a clinical trial exclusion criterion. Annotated with entity spans:
[Procedure: Immunosuppressive therapy] or [Condition: renal dialysis] ([Mood: current] or [Mood: planned] [Temporal: within the next 6 months]).